Clinical trial inclusion criterion:
No history of death, serious myocardial infarction, stroke, repeat revascularization, or major bleeding

Entity relations:
- Has_qualifier("bleeding", "major")
- Has_multiplier("revascularization", "repeat")
- Has_qualifier("myocardial infarction", "serious")
- Has_negation("death", "No")
- Has_temporal("death", "history")
- OR("death", "bleeding", "stroke", "myocardial infarction", "revascularization")